有關小腸的憩室疾病（diverticular disease）之敘述，下列何者錯誤？
A. 關於腸道 diverticular disease 的好發位置，小腸是僅次於大腸排名第二的
B. true diverticulum 和 false diverticulum 的差別，在於 false diverticulum 缺乏肌肉層
C. 診斷有腸道 diverticular disease 的患者，病患年紀很少小於 40 歲
D. 關於十二指腸的 diverticular disease，主要好發在 first portion 的位置

正確答案：D. 關於十二指腸的 diverticular disease，主要好發在 first portion 的位置